Clinical trial inclusion criterion:
Reference vessel diameter 2.75-4.0

Entity relations:
- Has_value("Reference vessel diameter", "2.75-4.0")